¿Qué afirmación es FALSA acerca de la enfermedad de Alzheimer?:
1. Es la causa de demencia más frecuente en los países occidentales.
2. Cursa con pérdida de memoria, principalmente la memoria explícita.
3. Esta causada por una lesión cerebral por problemas cerebrovasculares.
4. Es una demencia no reversible.

Respuesta correcta: 3. Esta causada por una lesión cerebral por problemas cerebrovasculares.